Clinical trial exclusion criterion:
PD on first-line therapy.

Annotated entities:
- Drug: "PD"
- Qualifier: "first-line therapy"